Clinical trial exclusion criterion:
Planning to move out of the area during the study time frame

Annotated entities:
- Non-query-able: "Planning to move out of the area during the study time frame"
- Context_Error: "Planning to move out of the area during the study time frame"